situation in which the procalcitonin concentration could be increased without correlation to an infectious process (poly-traumatised patients,

The above is a clinical trial exclusion criterion. Annotated with entity spans:
situation in which the [Measurement: procalcitonin concentration] could be [Qualifier: increased] without correlation to an infectious process ([Condition: poly-traumatised] patients,